Clinical trial exclusion criterion:
History of cardiogenic shock

Entity relations:
- Has_temporal("cardiogenic shock", "History")